= 18 years

The above is a clinical trial inclusion criterion. Annotated with entity spans:
[Person: = 18 years]